一位 35 歲男性從高處跌落，造成第七、八胸椎骨折脫位及脊髓損傷，導致雙側下肢癱瘓，肌力 0 分。 下列那一項徵象存在時，日後神經功能恢復預後最佳？
A. 踝陣攣現象（ankle clonus）
B. 巴氏反射現象（Babinski's sign）
C. 深層肌腱反射（deep tendon reflex）增強
D. 薦髓機能保留（sacral sparing）

正確答案：D. 薦髓機能保留（sacral sparing）